Clinical trial inclusion criteria:
Age 18 years or older
Blunt or penetrating trauma
Requires VTE thromboprophylaxis
High-risk for VTE

Annotated entities:
- Person: "Age"
- Value: "18 years or older"
- Condition: "penetrating trauma"
- Condition: "Blunt trauma"
- Condition: "VTE"
- Procedure: "thromboprophylaxis"
- Mood: "High-risk"
- Condition: "VTE"